下列有關初次和二次抗體反應，何者正確？
A. IgG 不會在初次反應中產生
B. 在針對 T-依賴性抗原的反應，抗體親和力（affinity）在二次反應較高
C. 二次反應的遲滯期（lag phase）較長，高原期（plateau phase）也較長
D. 抗體效價（titer）在二次反應時會降低

正確答案：B. 在針對 T-依賴性抗原的反應，抗體親和力（affinity）在二次反應較高